Pregnancy;

The above is a clinical trial exclusion criterion. Annotated with entity spans:
[Condition: Pregnancy];